Use of catheters

The above is a clinical trial exclusion criterion. Annotated with entity spans:
Use of [Device: catheters]